Clinical trial exclusion criteria:
Presence of severe systemic disease
Presence of coagulation disorders
Current or previous history of analgesic dependence
Allergy to any of the drugs used in the study
Women pregnant or lactating, or women planning to become pregnant
Presence of hearing loss
Presence of cardiovascular comorbidities
Presence of hepatic comorbidities
Presence of kidney comorbidities
Presence of cognitive disabilities

Annotated entities:
- Qualifier: "severe"
- Condition: "systemic disease"
- Condition: "coagulation disorders"
- Temporal: "Current"
- Temporal: "previous"
- Temporal: "history"
- Condition: "analgesic dependence"
- Drug: "analgesic"
- Condition: "Allergy"
- Drug: "drugs used in the study"
- Person: "Women"
- Condition: "pregnant"
- Condition: "lactating"
- Person: "women"
- Mood: "planning to become"
- Condition: "pregnant"
- Condition: "hearing loss"
- Condition: "cardiovascular comorbidities"
- Condition: "hepatic comorbidities"
- Condition: "kidney comorbidities"
- Condition: "cognitive disabilities"